Clinical trial exclusion criterion:
(1)Women who are pregnant and/or lactating; or women who intend to conceive within a year;

Entity relations:
- Has_temporal("intend to conceive", "within a year")
- OR("pregnant", "lactating")
- OR("Women", "women")
- OR("pregnant", "women")